Clinical trial exclusion criterion:
Established pre-existing diabetes (including unrecognised diabetes defined as a fasting plasma glucose = 7.0mmol/L and/ or HbA1c = 48mmol/mol); Contraindications to metformin therapy (creatinine = 130µmol/L/ alanine transaminase = 2.0 x upper limit normal/ previous intolerance to metformin)

Entity relations:
- Has_value("fasting plasma glucose", "= 7.0mmol/L")
- Has_value("HbA1c", "= 48mmol/mol)")
- AND("diabetes", "fasting plasma glucose")
- AND("Contraindications", "metformin")
- Has_value("creatinine", "= 130µmol/L/")
- Has_value("alanine transaminase", "= 2.0 x upper limit normal")
- AND("intolerance", "metformin")
- AND("Contraindications", "creatinine")
- OR("fasting plasma glucose", "HbA1c")
- OR("creatinine", "alanine transaminase", "intolerance")